Patients not scheduled for trans-jugular liver biopsy

The above is a clinical trial exclusion criterion. Annotated with entity spans:
Patients [Negation: not] [Mood: scheduled] for [Procedure: trans-jugular liver biopsy]